Clinical trial exclusion criterion:
have a history of solid organ or bone marrow transplant

Entity relations:
- Has_qualifier("solid organ transplant", "history")
- OR("solid organ transplant", "bone marrow transplant")